Clinical trial inclusion criterion:
Diabetic and nondiabetic patients

Annotated entities:
- Condition: "nondiabetic"
- Condition: "Diabetic"